Clinical trial exclusion criterion:
Primary sclerosing cholangitis

Annotated entities:
- Condition: "Primary sclerosing cholangitis"